Clinical trial exclusion criterion:
History of malignancy except for treated cervical carcinoma in situ in the past 5 years.

Annotated entities:
- Condition: "malignancy"
- Temporal: "History"
- Condition: "cervical carcinoma in situ"
- Qualifier: "treated"
- Procedure: "treated"
- Negation: "except for"
- Temporal: "in the past 5 years"